Clinical trial inclusion criterion:
Non-smoker for one year or more

Annotated entities:
- Condition: "smoker"
- Negation: "Non"
- Temporal: "for one year or more"